Clinical trial inclusion criterion:
Functional Class II and III by the New York Heart Association (NYHA)

Annotated entities:
- Measurement: "New York Heart Association (NYHA)"
- Value: "Class II and III"